Clinical trial exclusion criteria:
Patients with a personal or family history of medullary thyroid carcinoma or patients with Multiple Endocrine Neoplasia syndrome type 2
Patients with a prior serious hypersensitivity reaction to liraglutide
Other contra-indications to liraglutide in accordance with risks and safety information included in the latest updated prescribing information
Type 1 diabetes, as defined by ADA criteria
Current use of other GLP-1A, dipeptidyl peptidase 4 (DPP4) or Sodium Glucose transporters 2 (SGLT2) inhibitors, thiazolidinediones (TZDs), pramlintide and fixed prandial insulin.
Patients with unstable CAD, assessed by the Cardiology team and defined as new onset angina, rest angina, rapidly increasing or crescendo angina
History of diabetic ketoacidosis, pancreas or beta-cell transplantation, or diabetes secondary to pancreatitis or pancreatectomy; acute or chronic infective diseases, cancer or chemotherapy, history of pulmonary, renal or liver diseases, and drug abuse
Patients with chronic and acute inflammatory conditions such as sepsis, rheumatoid arthritis, ectopic dermatitis, asthma, ulcerative colitis.
Current use of systemic corticosteroids in the 3 months prior this study.
Pregnant or breast-feeding women
Females of childbearing potential who are not using adequate contraceptive methods (as required by local law or practice)

Annotated entities:
- Temporal: "personal history"
- Observation: "family history"
- Condition: "medullary thyroid carcinoma"
- Condition: "Multiple Endocrine Neoplasia syndrome type 2"
- Condition: "hypersensitivity reaction"
- Drug: "liraglutide"
- Temporal: "prior"
- Qualifier: "serious"
- Drug: "liraglutide"
- Condition: "contra-indications"
- Qualifier: "Other"
- Condition: "Type 1 diabetes"
- Qualifier: "ADA criteria"
- Drug: "GLP-1A"
- Qualifier: "other"
- Drug: "dipeptidyl peptidase 4 (DPP4) inhibitors"
- Drug: "Sodium Glucose transporters 2 (SGLT2) inhibitors"
- Drug: "thiazolidinediones (TZDs)"
- Drug: "pramlintide"
- Drug: "prandial insulin"
- Condition: "unstable CAD"
- Condition: "new onset angina"
- Condition: "rest angina"
- Condition: "rapidly increasing angina"
- Condition: "crescendo angina"
- Condition: "diabetic ketoacidosis"
- Procedure: "pancreas transplantation"
- Procedure: "beta-cell transplantation"
- Condition: "diabetes"
- Procedure: "pancreatitis"
- Procedure: "pancreatectomy"
- Qualifier: "secondary to"
- Qualifier: "acute"
- Qualifier: "chronic"
- Condition: "infective diseases"
- Condition: "cancer"
- Procedure: "chemotherapy"
- Condition: "liver diseases"
- Condition: "renal diseases"
- Condition: "pulmonary diseases"
- Condition: "drug abuse"
- Temporal: "History"
- Qualifier: "chronic"
- Qualifier: "acute"
- Condition: "inflammatory conditions"
- Condition: "sepsis"
- Condition: "rheumatoid arthritis"
- Condition: "ectopic dermatitis"
- Condition: "asthma"
- Condition: "ulcerative colitis"
- Temporal: "Current"
- Drug: "systemic corticosteroids"
- Temporal: "in the 3 months prior this study"
- Condition: "Pregnant"
- Condition: "breast-feeding women"
- Pregnancy_considerations: "Females of childbearing potential who are not using adequate contraceptive methods (as required by local law or practice)"